Clinical trial exclusion criterion:
History of recurrent UTI (defined as three culture proven UTIs within last 12 months)

Annotated entities:
- Condition: "recurrent UTI"
- Multiplier: "three"
- Measurement: "culture"
- Temporal: "within last 12 months"